Clinical trial inclusion criterion:
Subjects that are age 18-90

Annotated entities:
- Person: "age"
- Value: "18-90"